Subject with primary hypoactive sexual desire.

The above is a clinical trial exclusion criterion. Annotated with entity spans:
Subject with [Observation: primary hypoactive sexual desire].